Multiple pregnancy

The above is a clinical trial exclusion criterion. Annotated with entity spans:
[Condition: Multiple pregnancy]